Clinical trial exclusion criterion:
No complications due to other interventions

Annotated entities:
- Negation: "No"
- Procedure: "interventions"
- Qualifier: "other"
- Condition: "complications"